Hepatic or renal disease

The above is a clinical trial exclusion criterion. Annotated with entity spans:
[Condition: Hepatic] or [Condition: renal disease]